Clinical trial exclusion criterion:
Known or suspected liver diseases

Annotated entities:
- Condition: "liver diseases"
- Qualifier: "suspected"
- Qualifier: "Known"
- Subjective_judgement: "suspected"
- Undefined_semantics: "suspected"